Clinical trial exclusion criterion:
previous thoracic surgery

Annotated entities:
- Temporal: "previous"
- Procedure: "thoracic surgery"